previous brain surgery;

The above is a clinical trial exclusion criterion. Annotated with entity spans:
[Temporal: previous] [Procedure: brain surgery];